Clinical trial exclusion criterion:
Current severe illness, including heart, liver and renal failure, major organ allograft, malignancy requiring parenteral chemotherapy that can not be discontinued for the duration of the trial, or any other conditions which, in the opinion of the Investigator, would make the patient unsuitable for the study.

Annotated entities:
- Condition: "renal failure"
- Condition: "liver failure"
- Condition: "heart failure"
- Condition: "major organ allograft"
- Condition: "malignancy"
- Procedure: "chemotherapy"